Clinical trial exclusion criterion:
Previous treatment for glucose

Annotated entities:
- Procedure: "treatment for glucose"
- Temporal: "Previous"